En la entrevista a un paciente durante la etapa de valoración, las preguntas abiertas presentan una desventaja porque:
1. Pueden revelar la afectividad del entrevistado respecto a un aspecto.
2. Las respuestas son difíciles de registrar y hacerlo exige habilidad.
3. Dejan hablar al entrevistado.
4. Se concede demasiada importancia a las opiniones del entrevistado.
5. Pueden atraer el interés y la confianza por la libertad que proporcionan.

Respuesta correcta: 2. Las respuestas son difíciles de registrar y hacerlo exige habilidad.